Metabolic or hormonal abnormalities.

The above is a clinical trial exclusion criterion. Annotated with entity spans:
[Condition: Metabolic] or [Condition: hormonal abnormalities].